Any surgical or medical condition which might significantly alter the absorption, distribution, metabolism, or excretion of study drugs, including, but not limited to, any of the following: History of active inflammatory bowel disease during the 12 months. Active duodenal or gastric ulcers during the 3 months. Evidence of hepatic disease as determined by any one of the following: aspartate aminotransferase or alanine aminotransferase values exceeding 2x upper limit of normal, history of hepatic encephalopathy, history of oesophageal varices, or history of porto-caval shunt. Current treatment with cholestyramine or colestipol resins.

The above is a clinical trial exclusion criterion. Annotated with entity spans:
Any [Condition: surgical] or [Condition: medical condition] which might significantly [Condition: alter the absorption, distribution, metabolism, or excretion] of [Drug: study drugs], including, but not limited to, any of the following: History of [Qualifier: active] [Condition: inflammatory bowel disease] [Temporal: during the 12 months]. [Qualifier: Active] [Condition: duodenal] or [Condition: gastric ulcers] [Temporal: during the 3 months]. [Mood: Evidence] of [Condition: hepatic disease] as determined by any one of the following: [Measurement: aspartate aminotransferase] or [Measurement: alanine aminotransferase] values [Value: exceeding 2x upper limit of normal], [Temporal: history] of [Condition: hepatic encephalopathy], [Temporal: history] of [Condition: oesophageal varices], or [Temporal: history] of [Condition: porto-caval shunt]. [Temporal: Current] [Procedure: treatment] with [Drug: cholestyramine] or [Drug: colestipol resins].